Una señora está siendo tratada en el hospital por un problema respiratorio. El diagnóstico que identifica su enfermera es el de “Limpieza ineficaz de la vía respiratoria relacionada con secreciones acumuladas que obstruyen las vías respiratorias”. Después de cuatro días de tratamiento con ejercicios respiratorios, ingestión de líquidos, etc., la enfermera detecta que esta señora no ha recuperado la eficacia de su función respiratoria. Ambas acuerdan modificar el plan y aumentar los ejercicios con tos asistida y respiraciones profundas más frecuentes. Estas acciones se corresponden con la fase del proceso de enfermería de:
1. Valoración.
2. Diagnóstico.
3. Planificación.
4. Evaluación.
5. Revaluación.

Respuesta correcta: 4. Evaluación.